Clinical trial inclusion criteria:
1. Fasting glucose > 7.0 or have diabetes medication;
2. Male, 35-80 years; female, postmenopausal to 80 years;
3. Agree to participant in the trial.

Annotated entities:
- Measurement: "Fasting glucose"
- Value: "> 7.0"
- Drug: "diabetes medication"
- Condition: "diabetes"
- Undefined_semantics: "diabetes medication"
- Person: "Male"
- Person: "35-80 years"
- Value: "35-80 years"
- Person: "female"
- Condition: "postmenopausal"
- Person: "to 80 years"
- Value: "to 80 years"
- Post-eligibility: "Agree to participant in the trial."
- Non-query-able: "Agree to participant in the trial."